單就年齡層而言，下列何者自殺死亡之危險性最高？
A. 18-35 歲
B. 35-50 歲
C. 50-65 歲
D. 65 歲以上

正確答案：D. 65 歲以上